Subjects under the age of 21.

The above is a clinical trial exclusion criterion. Annotated with entity spans:
Subjects [Value: under the age of 21].